Willing to test for HIV

The above is a clinical trial inclusion criterion. Annotated with entity spans:
[Mood: Willing to] [Condition: test for HIV]